Clinical trial exclusion criteria:
Inpatient status, airway abnormalities, allergy to any study medications, eggs and soy, and mitochondrial disorders.
All subjects with any cardiac disease or history of cardiac arrhythmias will be excluded.

Annotated entities:
- Observation: "Inpatient status"
- Condition: "airway abnormalities"
- Condition: "allergy"
- Drug: "study medications"
- Drug: "eggs"
- Drug: "soy"
- Condition: "mitochondrial disorders"
- Condition: "cardiac disease"
- Condition: "cardiac arrhythmias"
- Temporal: "history"